Clinical trial exclusion criterion:
Patients with diabetes, Ischemic heart disease (IHD), stroke, malignancy and psychiatric diseases are excluded from study.

Annotated entities:
- Condition: "diabetes"
- Condition: "Ischemic heart disease (IHD)"
- Condition: "stroke"
- Condition: "malignancy"
- Condition: "psychiatric diseases"
- Grammar_Error: "and"